Producen mielina en el sistema nervioso central:
1. Astrocitos.
2. Células ependimarias.
3. Células satélites.
4. Células de Schwann.
5. Oligodendrocitos.

Respuesta correcta: 5. Oligodendrocitos.